Clinical trial inclusion criterion:
Not currently engaged in > 60 min/wk of exercise

Annotated entities:
- Negation: "Not"
- Observation: "engaged in exercise"
- Temporal: "currently"
- Value: "> 60 min/wk"